Newborns with infection of the umbilical cord at birth

The above is a clinical trial exclusion criterion. Annotated with entity spans:
[Person: Newborns] with [Condition: infection of the umbilical cord] [Temporal: at birth]